The patients are pregnant or lactational, or they refuse to practice contraception during the whole trial.

The above is a clinical trial exclusion criterion. Annotated with entity spans:
The patients are [Condition: pregnant] or [Condition: lactational], or they [Negation: refuse to practice] [Procedure: contraception] [Temporal: during the whole trial].